Clinical trial exclusion criterion:
A life expectancy (assessed by investigator) of less than 6 months or is no longer capable of taking medication orally.

Annotated entities:
- Observation: "life expectancy"
- Value: "less than 6 months"
- Non-query-able: "is no longer capable of taking medication orally"